What is the function of the ISW1 and CHD1 remodellers in yeast chromatin?

The ISW1 and CHD1 ATP-dependent chromatin remodelers compete to set nucleosome spacing in vivo. CHD1 and ISW1 compete to set the spacing on most genes, such that CHD1 dominates genes with shorter spacing and ISW1 dominates genes with longer spacing.